Clinical trial exclusion criterion:
20. History of cancer, except Stage 1 cervix or nonmelanotic skin cancer, with the possible exception of patients in complete remission

Annotated entities:
- Condition: "cancer"
- Temporal: "History"
- Condition: "skin cancer"
- Qualifier: "nonmelanotic"
- Qualifier: "Stage 1 cervix"
- Negation: "except"